Which endothelial cell migration pathways were modulated at the gene expression level by rHDL-apoE3?

The most pronounced effect was observed for EC migration, with 42/198 genes being involved in the following EC migration-related pathways: 1) MEK/ERK, 2) PI3K/AKT/eNOS-MMP2/9, 3) RHO-GTPases, and 4) integrin.